Clinical trial exclusion criterion:
Subjects who need to take the medicine which is prohibited during this study

Annotated entities:
- Context_Error: "the medicine which is prohibited during this study"
- Non-query-able: "need to take"